Andexanet Alfa is an antidote of which clotting factor inhibitors?

Andexanet alfa is a specific reversal agent for Factor Xa inhibitors.